節肢動物可當下列那些絛蟲的中間宿主？①豬肉絛蟲（Taenia solium） ②犬複殖器絛蟲（Dipylidium  caninum） ③縮小包膜絛蟲（Hymenolepis diminuta） ④單胞絛蟲（Echinococcus granulosus）
A. ①③
B. ①④
C. ②③
D. ②④

正確答案：C. ②③